List intramembrane rhomboid peptidases

PARL
Pcp1
hiGlpG
ecGlpG
YqgP